Administration of antineoplastic and immunomodulating agents or radiotherapy within 90 days prior to informed consent.

The above is a clinical trial exclusion criterion. Annotated with entity spans:
Administration of [Drug: antineoplastic] and [Drug: immunomodulating agents] or [Procedure: radiotherapy] [Temporal: within 90 days prior to informed consent].